Clinical trial exclusion criterion:
any serious adverse events that have a causal relationship with the inoculation of the upper dose of the vaccine

Annotated entities:
- Qualifier: "serious"
- Condition: "adverse events"
- Procedure: "inoculation of the upper dose of the vaccine"